Clinical trial inclusion criterion:
Ability to give informed consent

Annotated entities:
- Observation: "Ability to give informed consent"